Which cancer types are associated with mutations in the TWIST1 gene?

Loss-of-function mutations of TWIST1, a catalytic component of polycomb repressive complex 1 (PRC1), are observed in ~\n10% of patients with gastric, non-small cell lung, breast ductal carcinomas, nonsmall cell lung cancer, prostate cancer, female breast cancer, ovarian cancer, breast tumor, papillary thyroid cancer, and gastric cancer.